將胃內迷走神經傳入纖維（vagal afferent fibers）阻斷時，下列敘述何者正確？
A. 增加因組織胺（histamine）所刺激的胃酸分泌
B. 降低體抑素（somatostatin）的分泌
C. 降低因胃壁擴張（distension）所引起的胃酸分泌
D. 降低因胃內蛋白質食物刺激所引起的胃泌素（gastrin）分泌

正確答案：C. 降低因胃壁擴張（distension）所引起的胃酸分泌